What is particular about the 3D structure of the inactive X chromosome?

The inactive X chromosome (Xi) condenses into a bipartite structure with two superdomains of frequent long-range contacts, separated by a hinge region that is enriched in histone H3 lysine 27.